Internal, neurologic, rheumatologic or psychiatric disease including current heavy smoking (>20 cigarettes per day)

The above is a clinical trial exclusion criterion. Annotated with entity spans:
[Qualifier: Internal], [Qualifier: neurologic], [Qualifier: rheumatologic] or [Qualifier: psychiatric] [Condition: disease] including [Temporal: current] [Qualifier: heavy] [Observation: smoking] ([Value: >20] [Measurement: cigarettes per day])